Clinical trial exclusion criterion:
Hypertensive disorders of pregnancy,

Annotated entities:
- Condition: "Hypertensive disorders of pregnancy"